Allergy to any protocol medication

The above is a clinical trial exclusion criterion. Annotated with entity spans:
[Condition: Allergy] to any protocol medication